Clinical trial exclusion criterion:
Contraindications to study drugs

Entity relations:
- AND("Contraindications", "study drugs")